Clinical trial inclusion criterion:
Post-procedural thrombolysis in myocardial infarction (TIMI) grade 3 flow in treated vessels

Entity relations:
- Has_value("myocardial infarction grade", "3")
- Subsumes("myocardial infarction grade", "TIMI")
- multi("myocardial infarction grade", "myocardial infarction")
- Has_qualifier("Post-procedural thrombolysis", "treated vessels")